Clinical trial inclusion criterion:
=6 weeks postnatal age at randomization

Entity relations:
- Has_value("postnatal age", "=6 weeks")
- Has_temporal("postnatal age", "at randomization")